A daily alcohol intake >2 units/day.

The above is a clinical trial exclusion criterion. Annotated with entity spans:
A daily [Observation: alcohol] intake [Multiplier: >2 units/day].